Clinical trial exclusion criterion:
Acute or severe medical illness, i.e., delirium, metastatic cancer, decompensated cardiac, liver or kidney failure, major surgery, stroke or myocardial infarction during the three months prior to entry; or use of drugs known to cause depression, e.g., reserpine, alpha-methyl-dopa, steroids, sympathomimetics withdrawal;

Entity relations:
- Has_qualifier("medical illness", "Acute")
- Subsumes("medical illness", "delirium")
- Has_qualifier("cardiac failure", "decompensated")
- Has_temporal("medical illness", "three months prior to entry")
- AND("drugs", "depression")
- Subsumes("drugs", "reserpine")
- Has_index("three months prior to entry", "entry")
- OR("Acute", "severe")
- OR("delirium", "metastatic cancer", "cardiac failure", "major surgery", "stroke", "myocardial infarction")
- OR("cardiac failure", "liver failure", "kidney failure")
- OR("reserpine", "alpha-methyl-dopa", "steroids", "sympathomimetics withdrawal")
- OR("medical illness", "drugs")